Clinical trial exclusion criterion:
History of angioedema to treatment with ACE inhibitors or ARBs

Annotated entities:
- Condition: "angioedema"
- Procedure: "treatment"
- Drug: "ACE inhibitors"
- Drug: "ARBs"
- Temporal: "History of"